Clinical trial inclusion criterion:
parental permission and/or teen consent/assent as appropriate

Annotated entities:
- Informed_consent: "parental permission and/or teen consent/assent as appropriate"